Liver disease (known history of hepatitis B or C, cirrhosis, nonalcoholic steatohepatitis, history of alcoholism, ALT/AST greater than 3 times upper limit of normal in the past 3 months)

The above is a clinical trial exclusion criterion. Annotated with entity spans:
[Condition: Liver disease] (known [Temporal: history] of [Condition: hepatitis B] or C, [Condition: cirrhosis], [Condition: nonalcoholic steatohepatitis], [Temporal: history] of [Condition: alcoholism], [Measurement: ALT/AST] [Value: greater than 3 times upper limit of normal] [Temporal: in the past 3 months])